Subjects with controlled diabetes prior to entry must have a mean systolic/diastolic office blood pressure =128/78 mmHg (sitting, after 5 minutes of rest)

The above is a clinical trial inclusion criterion. Annotated with entity spans:
Subjects with [Qualifier: controlled] [Condition: diabetes] [Temporal: prior to entry] must have a [Condition: mean] systolic/diastolic office blood pressure =[Value: 128]/[Value: 78 mmHg] ([Qualifier: sitting], [Temporal: after 5 minutes of rest])